Clinical trial exclusion criterion:
Infection or injury or a lesion at the block site.

Annotated entities:
- Condition: "Infection"
- Condition: "injury"
- Condition: "lesion"
- Qualifier: "at the block site"